Clinical trial exclusion criterion:
history of neurological disorders which might affect sensation such as previous stroke or peripheral neuropathy

Annotated entities:
- Condition: "neurological disorders"
- Condition: "stroke"
- Condition: "peripheral neuropathy"
- Condition: "affect sensation"